secondary osteosarcoma or well-differentiated parosteal osteosarcoma

The above is a clinical trial exclusion criterion. Annotated with entity spans:
[Condition: secondary osteosarcoma] or [Qualifier: well-differentiated] [Condition: parosteal osteosarcoma]